Clinical trial inclusion criterion:
Presence of hemodynamically relevant stenosis of one artery (i.e., the infarct-related artery) confirmed by coronary angiography (CAG), with the occlusion of other arteries not exceeding 30%.

Annotated entities:
- Condition: "stenosis of artery"
- Multiplier: "one"
- Condition: "infarct-related artery"
- Qualifier: "hemodynamically relevant"
- Procedure: "coronary angiography"
- Procedure: "CAG"
- Condition: "occlusion of other arteries"
- Multiplier: "not exceeding 30%"